Clinical trial inclusion criterion:
Failure of medical treatment or rehabilitation.

Entity relations:
- Has_qualifier("medical treatment", "Failure")
- OR("medical treatment", "rehabilitation")